known pregnancy

The above is a clinical trial exclusion criterion. Annotated with entity spans:
known [Condition: pregnancy]